Terminal patient

The above is a clinical trial exclusion criterion. Annotated with entity spans:
[Qualifier: Terminal] [Person: patient]